1. Unable to ambulate at least 150 feet prior to stroke, or experienced intermittent claudication while walking;

The above is a clinical trial exclusion criterion. Annotated with entity spans:
[Parsing_Error: 1.] [Condition: Unable to ambulate at least 150 feet] [Temporal: prior] to [Condition: stroke], or experienced [Condition: intermittent claudication] [Qualifier: while walking];